下列有關發熱性非溶血性輸血反應的敘述，何者錯誤？
A. 是輸注血球成分血常見的反應
B. 常肇因於受血者（recipient）體內有對抗給血者（donor）白血球的抗體
C. 在輸血時，將血球成分血通過白血球過濾器（filter），可完全避免此輸血反應的發生
D. 可用退燒解熱劑，如 acetaminophen 治療或預防

正確答案：C. 在輸血時，將血球成分血通過白血球過濾器（filter），可完全避免此輸血反應的發生